Clinical trial exclusion criterion:
Dual organ or kidney after another solid organ transplant

Annotated entities:
- Procedure: "solid organ transplant"
- Condition: "Dual organ"
- Condition: "Dual kidney"